Signed consent, and when age appropriate, signed assent

The above is a clinical trial inclusion criterion. Annotated with entity spans:
[Post-eligibility: Signed consent, and when age appropriate, signed assent]